Clinical trial exclusion criterion:
History of hypersensitivity or adverse reaction to local anesthetics, opioid, or any ingredient of the medications administered in this study.

Entity relations:
- AND("hypersensitivity", "local anesthetics")
- OR("local anesthetics", "ingredient of the medications administered in this study", "opioid")
- OR("hypersensitivity", "adverse reaction")